Clinical trial inclusion criterion:
Clinical indication for statins for primary or secondary prevention of cardiovascular disease or dyslipidaemia, on either no medication or non-statin lipid lowering therapy (e.g, ezetimibe)

Entity relations:
- AND("indication", "statins")
- Has_qualifier("prevention of cardiovascular disease", "primary")
- Subsumes("indication", "prevention of cardiovascular disease")
- OR("primary", "secondary")
- OR("prevention of cardiovascular disease", "dyslipidaemia")